65 歲的孫先生，右肩在外轉（external rotation）並外展（abduction）時疼痛不堪。他因此無法將右臂抬高到比肩高，造成搭公車時無法去抓握車頂的握桿。醫師發現他疼痛的部位大約在肩部的外上方，但是如果請他忍住疼痛，醫師可以把他的右臂被動地向前舉高到比肩還高。孫先生最有可能患了下列何症？
A. 肩胛上神經夾陷症（suprascapular nerve entrapment）
B. 冰凍肩（frozen shoulder）
C. 夾擊症候群（impingement syndrome）
D. 肱二頭肌肌腱（biceps tendon）斷裂

正確答案：C. 夾擊症候群（impingement syndrome）